Son conceptos que se refieren a la misma probabilidad el nivel de:
1. Confianza y el error tipo II:
2. Significación y el error tipo I.
3. Significación y la especificidad.
4. Confianza y la sensibilidad.
5. Significación y el error tipo II.

Respuesta correcta: 2. Significación y el error tipo I.